下列那一個不是青少年時期常見的惡性疾病？
A. 骨肉瘤（osteosarcoma）
B. 依文氏肉瘤（Ewing sarcoma）
C. 急性白血病（acute leukemia）
D. 神經母細胞瘤（neuroblastoma）

正確答案：D. 神經母細胞瘤（neuroblastoma）